Un paciente con historia de consumo excesivo de alcohol ha sido diagnosticado de tuberculosis pulmonar por un cuadro de tos, fiebre, expectoración, aislándose en el cultivo de esputo Mycobacterium tuberculosis. El paciente ha iniciado tratamiento con isoniacida, rifampicina, etambutol y pirazinamida, con adecuada tolerancia. A los 20 días del inicio del tratamiento se recibe un informe de resistencia a rifampicina del M. tuberculosis aislado en el esputo. ¿Qué régimen seleccionaría en función de este informe?
1. Isoniacida, etambutol, pirazinamida durante 12 meses.
2. Isoniacida, etambutol, pirazinamida durante 12 meses y estreptomicina por dos meses.
3. Isoniacida, etambutol, pirazinamida durante 12 meses y una quinolona por dos meses.
4. Isoniacida, etambutol, pirazinamida y una quinolona durante 18 meses.
5. Isoniacida, etambutol, pirazinamida durante 18 meses y estreptomicina y una quinolona durante dos meses.

Respuesta correcta: 4. Isoniacida, etambutol, pirazinamida y una quinolona durante 18 meses.